14. Females of childbearing potential must have a negative pregnancy test (urine β-hCG).

The above is a clinical trial inclusion criterion. Annotated with entity spans:
14. [Pregnancy_considerations: Females of childbearing potential must have a negative pregnancy test (urine β-hCG).]